糖尿病引起的神經病變（diabetic neuropathy）以何者最常見？
A. 第三對腦神經病變（diabetic ophthalmoplegia）
B. 多條神經病變（mononeuritis multiplex）
C. 遠端性神經病變（distal polyneuropathy）
D. 自主神經病變（autonomic neuropathy）

正確答案：C. 遠端性神經病變（distal polyneuropathy）